腦外傷病人於復健過程中可能會發生癲癇（seizure），以下敘述何者錯誤？
A. 好發期約是受傷後 2 年內
B. 為預防癲癇發作而終身給藥是必須的
C. Carbamazepine 較不影響認知功能
D. 發生機率與腦傷的嚴重度與部位有關

正確答案：B. 為預防癲癇發作而終身給藥是必須的